Clinical trial exclusion criterion:
Liver biopsy at any time showing mHAI stage 4 or higher fibrosis OR

Annotated entities:
- Procedure: "Liver biopsy"
- Measurement: "mHAI stage"
- Value: "4 or higher"
- Temporal: "any time"